Clinical trial inclusion criterion:
Computerised Tomography (CT) scan of chest and abdomen within 28 days of starting pembrolizumab.

Annotated entities:
- Procedure: "Computerised Tomography (CT) scan of chest and abdomen"
- Temporal: "within 28 days of starting pembrolizumab"
- Reference_point: "starting pembrolizumab"
- Drug: "pembrolizumab"